Patient presented for induction of labor who is determined to be a candidate for oxytocin

The above is a clinical trial inclusion criterion. Annotated with entity spans:
Patient [Mood: presented for] [Procedure: induction of labor] who is determined to be a [Condition: candidate for oxytocin]